indication to surgery (symptoms of menometrorrhagia,

The above is a clinical trial inclusion criterion. Annotated with entity spans:
[Mood: indication to] [Procedure: surgery] (symptoms of [Condition: menometrorrhagia],